Clinical trial inclusion criterion:
Demonstrate a positive cough stress test during complex multi-channel urodynamic testing

Entity relations:
- Has_value("cough stress test", "positive")
- causal("cough stress test", "complex multi-channel urodynamic testing")